¿Cuál de los siguientes métodos de cálculo de la fiabilidad no puede llevarse a cabo con una sola aplicación del test?
1. Coeficiente Alfa de Cronbach.
2. Guttman-Flanagan.
3. Rulon.
4. Método de las formas paralelas.
5. Método de las dos mitades.

Respuesta correcta: 4. Método de las formas paralelas.